La presencia de pródromos inespecíficos en un trastorno psicótico:
1. Se refiere a una de las tres fases en las que evoluciona un episodio psicótico.
2. Se refiere a la fase aguda.
3. Se refiere a la fase de recuperación.
4. Define el comienzo brusco del primer episodio psicótico.
5. Es una fase en las que el paciente no precisa tratamiento.

Respuesta correcta: 1. Se refiere a una de las tres fases en las que evoluciona un episodio psicótico.